Creatinine clearance = 60 ml/min (via Cockcroft-Gault formula)

The above is a clinical trial inclusion criterion. Annotated with entity spans:
[Measurement: Creatinine clearance] [Value: = 60 ml/min] (via [Measurement: Cockcroft-Gault formula])